Clinical trial inclusion criterion:
2. Patient is scheduled for a non-emergency procedure.

Annotated entities:
- Procedure: "non-emergency procedure"
- Qualifier: "non-emergency"
- Mood: "scheduled"